下列何者不是無症狀之非小細胞肺癌病人分期必須做之檢查？
A. 胸部及腹部之 CT scan
B. 骨之同位素掃描（bone scan）
C. 腦部之 CT scan
D. 支氣管鏡檢查

正確答案：C. 腦部之 CT scan